Clinical trial exclusion criterion:
(3)History of adverse reactions or intolerance to enalapril or other ACE inhibitors, or drugs or supplements containing folic acid;

Annotated entities:
- Temporal: "History"
- Condition: "adverse reactions"
- Condition: "intolerance"
- Drug: "enalapril"
- Qualifier: "other"
- Drug: "ACE inhibitors"
- Drug: "folic acid"